¿Cuál de los efectos adversos reseñados es característico de las dihidropiridinas?:
1. Broncoconstricción.
2. Calambres musculares, localizados preferentemente en las extremidades.
3. Edemas periféricos, localizados preferentemente en las piernas.
4. Tos seca, que remite al interrumpir el tratamiento.

Respuesta correcta: 3. Edemas periféricos, localizados preferentemente en las piernas.